Clinical trial inclusion criterion:
Standard-risk (SR) group meeting all of the following criteria:

Annotated entities:
- Line: "Standard-risk (SR) group meeting all of the following criteria"
- Measurement: "Standard-risk"
- Measurement: "SR"
- Multiplier: "all"
- Measurement: "criteria"